分化良好甲狀腺癌的手術選擇中，有關甲狀腺全切除術，下列敘述何者錯誤？
A. 能減少副甲狀腺功能低下及喉返神經受傷等併發症
B. 手術後可用甲狀腺球蛋白做為標記追蹤
C. 可增加手術後碘-131（iodine-131）治療效果
D. 需終生服用甲狀腺素

正確答案：A. 能減少副甲狀腺功能低下及喉返神經受傷等併發症